Clinical trial inclusion criterion:
singleton pregnancy

Annotated entities:
- Condition: "pregnancy"
- Qualifier: "singleton"